下列有關括約肌切開術（transurethral sphincterotomy）應用於神經性排尿障礙的敘述，何者最正確？
A. 適用於女性
B. 適用於馬尾束病變排尿困難者
C. 手術方法是利用膀胱鏡將括約肌完全切除
D. 手術目的是降低尿道阻力，促進排尿

正確答案：D. 手術目的是降低尿道阻力，促進排尿